Los medicamentos de los que existe ausencia o insuficiencia de suministro en el mercado nacional, siendo necesarios para el tratamiento de determinadas enfermedades o patologías, se denominan:
1. Medicamentos huérfanos.
2. Medicamentos de investigación.
3. Medicamentos sin interés comercial.
4. Medicamentos falsificados.

Respuesta correcta: 3. Medicamentos sin interés comercial.